Clinical trial exclusion criterion:
Use of corticosteroids/other antithrombotic agents(warfarin)

Annotated entities:
- Drug: "corticosteroids"
- Drug: "antithrombotic agents"
- Drug: "warfarin"